Clinical trial exclusion criterion:
Allergy to acetaminophen

Annotated entities:
- Drug: "acetaminophen"
- Condition: "Allergy"